Clinical trial exclusion criterion:
peridevice leak >5mm on transesophageal echocardiography study preceding enrollment

Annotated entities:
- Measurement: "peridevice leak"
- Value: ">5mm"
- Procedure: "transesophageal echocardiography study"